Pregnancy and lactation period.

The above is a clinical trial exclusion criterion. Annotated with entity spans:
[Condition: Pregnancy] and [Condition: lactation period].